下列何項檢查結果對診斷單純疱疹性腦炎（herpes simplex encephalitis）最不具有特異性？
A. 腦脊髓液的單純疱疹病毒的PCR（polymerase chain reaction）檢查呈陽性反應
B. 腦部磁振照影檢查發現大腦之額葉和顳葉受侵犯
C. 腦波出現單側週期性癲癇波（periodic lateralized epileptic discharges, PLEDs）
D. 血清中抗疱疹病毒抗體上升

正確答案：D. 血清中抗疱疹病毒抗體上升